Clinical trial exclusion criterion:
Positive urine drug screen for cannabinoids and other potential abuse substances (e.g. alcohol, cocaine, amphetamines and methamphetamines, unprescribed opioids)

Annotated entities:
- Measurement: "urine drug screen"
- Value: "Positive"
- Drug: "cannabinoids"
- Drug: "alcohol"
- Drug: "cocaine"
- Drug: "amphetamines"
- Drug: "methamphetamines"
- Drug: "opioids"
- Qualifier: "unprescribed"